The patient is participating in another clinical study using an investigational product.

The above is a clinical trial exclusion criterion. Annotated with entity spans:
[Competing_trial: The patient is participating in another clinical study using an investigational product].